Clinical trial exclusion criterion:
Any other reason the investigator deems subject is unfit for participation in the study

Annotated entities:
- Non-query-able: "Any other reason the investigator deems subject is unfit for participation in the study"